下列關於體質性生長遲延（constitutional growth delay）的描述，何者不正確？
A. 出生時身長及體重往往正常
B. 於 2 - 3 歲後，生長速率正常
C. 常伴有青春期遲延（delayed puberty）的現象
D. 成人期之身高常較矮小

正確答案：D. 成人期之身高常較矮小